Clinical trial exclusion criterion:
10. For females, pregnancy or breast-feeding

Entity relations:
- AND("females", "pregnancy")
- OR("pregnancy", "breast-feeding")